Clinical trial exclusion criterion:
All patients who were wheelchair bound preoperatively

Entity relations:
- Has_qualifier("wheelchair bound", "preoperatively")